下列何者不是造成牽引型視網膜剝離（tractional retinal detachment）的主要原因？
A. 增殖型糖尿病視網膜病變（proliferative diabetic retinopathy）
B. 鐮刀狀細胞性視網膜病變（sickle cell retinopathy）
C. 早產兒視網膜病變（retinopathy of prematurity）
D. 格子狀視網膜變性（lattice retinal degeneration）

正確答案：D. 格子狀視網膜變性（lattice retinal degeneration）